Originan diarreas en los niños los:
1. Togavirus.
2. Coronavirus.
3. Arenavirus.
4. Parvovirus.
5. Astrovirus.

Respuesta correcta: 5. Astrovirus.